化學治療合併的副作用，下列何者關係較不明確？
A. doxorubicin與心臟毒性
B. bleomycin與肺部纖維化
C. cisplatin與腎臟毒性
D. carboplatin與出血性膀胱炎

正確答案：D. carboplatin與出血性膀胱炎